Clinical trial exclusion criterion:
Contraindications to warfarin or pradaxa according to Russian Instructions for medical use of these drugs

Entity relations:
- AND("Contraindications", "warfarin")
- Has_qualifier("Contraindications", "Russian Instructions for medical use")
- OR("warfarin", "pradaxa")